下列有關 warfarin 之敘述，何者錯誤？
A. 直接抑制 vitamin K 有關之凝血因子 II, VII, IX, X 進行 γ-carboxylation 修飾
B. 直接抑制 epoxide reductase，使還原型 vitamin K 不能再生
C. protein C 合成不受影響
D. 其抗凝血作用比 heparin 之起始作用時間（onset）慢

正確答案：C. protein C 合成不受影響